Clinical trial exclusion criterion:
temperature=37.1<U+2103> and infectious diseases

Annotated entities:
- Measurement: "temperature"
- Value: "=37.1<U+2103>"
- Condition: "infectious diseases"